革蘭氏陰性菌分泌的內毒素（endotoxin）會調控小腸 Cl-的分泌，其作用是因為活化小腸上皮細胞具有那種酵素活性的受器（receptor）所致？
A. Tyrosine kinase
B. Guanylyl cyclase
C. Tyrosine phosphatase
D. Serine kinase 47 	G 蛋白耦合受體（G-protein-coupled receptor）是屬於下列那一類型的受體？

正確答案：B. Guanylyl cyclase